Clinical trial inclusion criterion:
Non-smoking

Annotated entities:
- Condition: "Non-smoking"